Clinical trial exclusion criteria:
Richter's syndrome, Burkitt's lymphoma, or Burkitt-like Lymphoma (transformed DLBCL from Follicular NHL are eligible).
Prior transplant with stem cell infusion 90 days or active graft-versus-host treatment within 8 weeks of Day 1.
Prior therapy with SYK inhibitors.
Chronic treatment with strong CYP3A4 inhibitor/ inducer, acid reducing agent, Proton pump inhibitors
Known lymphomatous involvement of the CNS.
Persistent, unresolved NCI CTCAE v4.0 ≥ Grade 2, previous drug-related toxicity (except alopecia, erectile impotence, hot flashes, libido, neuropathy).
Prior monoclonal antibody, radioimmunoconjugate, antibody drug conjugate, phototherapy, radiotherapy, chemotherapy, immunotherapy, immunosuppressive therapy, or any test agent within 3 weeks or for alemtuzumab 8 weeks of Day 1.
For CTCL: (TSEBT) within 12 weeks, or initiation of topical steroid, nitrogen mustard, or topical retinoid within 2 weeks. (Stable topical ≥ 4 weeks prior to Day 1 allowed).
Known carrier or infection for HIV/Hep B or C. HCV ab+ must be PCR-. HBV ab+ must be HBsAg- or undetectable DNA
Active infection requiring systemic treatment,
Significant GI disease, previous major gastric/bowel surgery, difficulty swallowing or malabsorption syndrome.
Major surgery within 4 weeks
Previous malignancies within 2 yrs. unless relapse risk is small (< 5%).
Current use of systemic steroids >20 mg QD prednisone (or equivalent)
Breastfeeding or pregnant (intention to become) females or participation in other clinical trials

Annotated entities:
- Condition: "Richter's syndrome"
- Condition: "Burkitt's lymphoma"
- Condition: "Burkitt-like Lymphoma"
- Condition: "DLBCL"
- Condition: "Follicular NHL"
- Procedure: "transplant"
- Procedure: "stem cell infusion"
- Temporal: "90 days of Day 1"
- Temporal: "active"
- Procedure: "graft-versus-host treatment"
- Temporal: "within 8 weeks of Day 1"
- Temporal: "Prior"
- Drug: "SYK inhibitors"
- Procedure: "therapy"
- Temporal: "Prior"
- Drug: "strong CYP3A4 inhibitor"
- Drug: "strong CYP3A4 inducer"
- Drug: "acid reducing agent"
- Drug: "Proton pump inhibitors"
- Condition: "lymphomatous involvement of the CNS"
- Undefined_semantics: "lymphomatous involvement of the CNS"
- Measurement: "NCI CTCAE v4.0"
- Value: "≥ Grade 2"
- Condition: "drug-related toxicity"
- Temporal: "previous"
- Condition: "alopecia"
- Negation: "except"
- Condition: "erectile impotence"
- Condition: "hot flashes"
- Condition: "libido"
- Condition: "neuropathy"
- Drug: "monoclonal antibody"
- Drug: "radioimmunoconjugate"
- Drug: "antibody drug conjugate"
- Procedure: "phototherapy"
- Procedure: "radiotherapy"
- Procedure: "chemotherapy"
- Procedure: "immunotherapy"
- Procedure: "immunosuppressive therapy"
- Temporal: "within 3 weeks of Day 1"
- Drug: "alemtuzumab"
- Temporal: "8 weeks of Day 1"
- Reference_point: "Day 1"
- Condition: "CTCL"
- Procedure: "TSEBT"
- Temporal: "within 12 weeks"
- Drug: "topical steroid"
- Observation: "initiation"
- Drug: "nitrogen mustard"
- Drug: "topical retinoid"
- Temporal: "within 2 weeks"
- Temporal: "≥ 4 weeks prior to Day 1"
- Reference_point: "Day 1"
- Grammar_Error: "allowed"
- Condition: "infection for HIV"
- Condition: "Hep B infection for"
- Condition: "Hep C infection for"
- Condition: "HCV ab+"
- Qualifier: "PCR-"
- Condition: "HBV ab+"
- Qualifier: "HBsAg-"
- Condition: "undetectable DNA"
- Condition: "infection"
- Procedure: "systemic treatment"
- Qualifier: "requiring systemic treatment"
- Condition: "GI disease"
- Qualifier: "Significant"
- Subjective_judgement: "Significant"
- Procedure: "bowel surgery"
- Procedure: "gastric surgery"
- Qualifier: "major"
- Subjective_judgement: "major"
- Condition: "difficulty swallowing"
- Condition: "malabsorption syndrome"
- Procedure: "surgery"
- Qualifier: "Major"
- Undefined_semantics: "Major"
- Subjective_judgement: "Major"
- Temporal: "within 4 weeks"
- Condition: "malignancies"
- Temporal: "within 2 yrs."
- Non-query-able: "unless relapse risk is small (< 5%)"
- Subjective_judgement: "unless relapse risk is small (< 5%)"
- Undefined_semantics: "unless relapse risk is small (< 5%)"
- Drug: "systemic steroids"
- Multiplier: ">20 mg QD"
- Drug: "prednisone"
- Observation: "Breastfeeding"
- Condition: "pregnant"
- Person: "females"